有關圓錐角膜（keratoconus）的敘述，下列何者錯誤？
A. 通常於青春期發病，而後緩慢進行
B. 近視及散光會逐漸增加
C. 角膜厚度逐漸變厚，導致角膜弧度變凸
D. 唐氏症（Down Syndrome）可伴隨圓錐角膜

正確答案：C. 角膜厚度逐漸變厚，導致角膜弧度變凸